¿Qué hormona es responsable del mantenimiento del cuerpo lúteo en los primeros días de implantación?:
1. Lactógeno placentario.
2. Hormona de crecimiento.
3. Hormona adrenocorticotropa.
4. Gonadotropina coriónica.

Respuesta correcta: 4. Gonadotropina coriónica.